Clinical trial exclusion criterion:
Weigh >300 lbs

Annotated entities:
- Measurement: "Weigh"
- Value: ">300 lbs"